Clinical trial exclusion criteria:
Subjects who have systemic infection
Subjects who have human Immunodeficiency virus (HIV), hepatitis B virus (HBV), and hepatitis C virus (HCV)
Subjects who need to take the medicine which is prohibited during this study
Subjects who have asthma
Subjects who can not stop treatment with topical steroids (group 1~5), oral antibiotics, whole body photochemotherapy, immunosuppressive drug within 4 weeks before the treatment visit
Pregnant, breast-feeding women or women who plan to become pregnant during this study (Females of childbearing potential must have a negative urine pregnancy test)
Subjects who currently participate in other clinical trial or participated in other clinical trial within 30 days
Subjects who had a serious adverse events during stem cell therapy
Subjects who had a hypersensitivity to antibiotics or antimycotics
Subjects who creatinine value is more than two times of the upper limit of the normal range at screening test
Subjects who aspartate transaminase/alkaline transaminase (AST/ALT) value is more than three times of the upper limit of the normal range at screening test
Subjects who have any other condition which the investigator judges would make patients unsuitable for study participation

Annotated entities:
- Condition: "systemic infection"
- Condition: "human Immunodeficiency virus (HIV)"
- Condition: "hepatitis B virus (HBV)"
- Condition: "hepatitis C virus (HCV)"
- Grammar_Error: "and"
- Context_Error: "the medicine which is prohibited during this study"
- Non-query-able: "need to take"
- Condition: "asthma"
- Non-query-able: "can not stop"
- Drug: "topical steroids"
- Context_Error: "group 1~5"
- Drug: "oral antibiotics"
- Procedure: "whole body photochemotherapy"
- Drug: "immunosuppressive drug"
- Temporal: "within 4 weeks before"
- Reference_point: "treatment visit"
- Condition: "Pregnant"
- Condition: "breast-feeding"
- Person: "women"
- Person: "women"
- Non-query-able: "plan to become"
- Condition: "pregnant"
- Temporal: "during this study"
- Condition: "childbearing potential"
- Person: "Females"
- Measurement: "urine pregnancy test"
- Value: "negative"
- Non-query-able: "Subjects who currently participate in other clinical trial or participated in other clinical trial within 30 days"
- Context_Error: "Subjects who currently participate in other clinical trial or participated in other clinical trial within 30 days"
- Undefined_semantics: "serious adverse events"
- Condition: "serious adverse events"
- Temporal: "during"
- Reference_point: "stem cell therapy"
- Procedure: "stem cell therapy"
- Condition: "hypersensitivity"
- Drug: "antibiotics"
- Drug: "antimycotics"
- Measurement: "creatinine"
- Value: "more than two times of the upper limit of the normal range"
- Temporal: "at screening test"
- Reference_point: "screening test"
- Measurement: "aspartate transaminase/alkaline transaminase (AST/ALT)"
- Value: "more than three times of the upper limit of the normal range"
- Temporal: "at screening test"
- Reference_point: "screening test"
- Condition: "any other condition"
- Qualifier: "the investigator judges would make patients unsuitable for study participation"
- Subjective_judgement: "the investigator judges would make patients unsuitable for study participation"
- Undefined_semantics: "the investigator judges would make patients unsuitable for study participation"
- Context_Error: "the investigator judges would make patients unsuitable for study participation"